Clinical trial inclusion criterion:
Reduced HDL-cholesterol (<40mg/dl in men, <50 mg/dl in women), or on medication for treating the condition

Annotated entities:
- Value: "Reduced"
- Measurement: "HDL-cholesterol"
- Value: "<40mg/dl"
- Value: "<50 mg/dl"
- Person: "women"
- Person: "men"
- Drug: "medication for treating"
- Qualifier: "HDL-cholesterol"